Clinical trial exclusion criterion:
Positive result of Cross Match.

Annotated entities:
- Procedure: "Cross Match"
- Value: "Positive"